一位 30 歲女性病人，最近一週發燒及下肢水腫就醫。身體診察：意識清楚，口溫 38.2°C，血壓 170/100 mmHg，脈搏 76/min，呼吸 16/min，眼底、肺部、心臟、腹部和四肢關節均無異常，但下肢有顯著壓陷性水腫。血液生化檢查：尿素氮 35 mg/dL，肌酸酐 3.0 mg/dL。血清 anti-neutrophil cytoplasmic antibody（ANCA）陰性，anti-nuclear antibody 陽性，尿液檢查：蛋白質(3+)，紅血球 顆/高倍視野，紅血球圓柱體(+)，下列何項檢查對確立診斷有幫助？
A. 類風濕因子（rheumatoid factor）
B. C 型肝炎抗體（anti-hepatitis C virus antibody）
C. 雙股去氧核糖核酸抗體（anti-double stranded DNA antibody）
D. 冷凝球蛋白（cryoglobulin）

正確答案：C. 雙股去氧核糖核酸抗體（anti-double stranded DNA antibody）